Clinical trial exclusion criterion:
Gelatin allergy

Entity relations:
- AND("allergy", "Gelatin")